Clinical trial inclusion criterion:
Ability to speak and understand English

Entity relations:
- OR("Ability to understand English", "Ability to speak English")